Clinical trial exclusion criterion:
Abnormal renal function

Entity relations:
- Has_value("renal function", "Abnormal")
- multi("Abnormal renal function", "renal function")